Clinical trial exclusion criterion:
Subjects who are immediate candidates for an ICD

Entity relations:
- Has_mood("ICD", "candidates for")
- Has_temporal("ICD", "immediate")